Paciente de 54 años de edad, con una ingesta etílica de 110 g/día, que ingresa por un cuadro de diarrea crónica y con la aparición en los últimos días de calambres musculares. En la analítica destaca glucosa 320 mg/dL, Urea 25 mg/dL, Creatinina 0,75 mg/dL, Potasio 2,5 mmol/L (3,5-5,1), Calcio 2,0 mmol/L (2,2-2,5), Fósforo 0,52 mmol/L (0,87-1,55) Magnesio 0,25 mmol/L (0,66-0,99) y Albúmina de 28 g/L (3552) ¿Con qué iniciaría el tratamiento?
1. Insulina.
2. Potasio.
3. Calcio.
4. Fósforo.
5. Magnesio.

Respuesta correcta: 5. Magnesio.